Clinical trial exclusion criterion:
Patients who receive antineoplastic or immunomodulatory therapy in the past 12 months.

Entity relations:
- Has_temporal("antineoplastic therapy", "past 12 months")
- Has_temporal("immunomodulatory therapy", "past 12 months")